下列有關血氧飽和度監視器（pulse oximeter）的敘述，何者錯誤？
A. 主要利用血紅素對 660 nm 及 940 nm 光譜的吸收能力，來分辨血氧飽和度
B. 可分辨正常血紅素和 carboxyhemoglobin 的差異，因此對一氧化碳中毒病人的監視，非常有價值
C. 為麻醉病人的基本監視儀器
D. 在正常大氣壓及正常血紅素時，當飽和度為 90%，動脈血氧分壓大約為 60 mmHg（PaO2）

正確答案：B. 可分辨正常血紅素和 carboxyhemoglobin 的差異，因此對一氧化碳中毒病人的監視，非常有價值